El incremento mínimo en la estimulación que permite detectar un cambio en la sensación, es conocido como:
1. Umbral absoluto.
2. Umbral diferencial.
3. Umbral de contraste.
4. Umbral de eco.

Respuesta correcta: 2. Umbral diferencial.